Clinical trial exclusion criterion:
Allergy or intolerance to (N)OAC or clopidogrel.

Entity relations:
- AND("Allergy", "(N)OAC")
- OR("(N)OAC", "clopidogrel")
- OR("Allergy", "intolerance")